軸式皮瓣（axial pattern flap）的血液循環來自：
A. 皮動脈及靜脈（cutaneous artery and vein）
B. 只靠組織液之滲透供應其所需之營養
C. 靠肌肉之血管（myocutaneous perforators）
D. 只靠真皮之微血管（subdermal plexus）

正確答案：A. 皮動脈及靜脈（cutaneous artery and vein）